下列何者是黴漿菌（Mycoplasma）所特有，且必須藉動物血清添加於培養基中以利其生長的成分？
A. 脂醇（sterols）
B. 白蛋白（albumin）
C. 醣蛋白（glycoproteins）
D. 醣脂質（glycolipids）

正確答案：A. 脂醇（sterols）